concomitant massage

The above is a clinical trial exclusion criterion. Annotated with entity spans:
[Temporal: concomitant] [Procedure: massage]